What is the function of the Spt6 gene in yeast?

These effects are mediated through interactions with histones, transcription factors, and the RNA polymerase. Spt6 is a highly conserved factor required for normal transcription and chromatin structure. Two lines of evidence suggest that Spt6 also plays a role in rRNA synthesis. We identify the histone H3-H4 chaperone Spt6 as the factor that mediates nucleosome reassembly onto the PHO5, PHO8, ADH2, ADY2, and SUC2 promoters during transcriptional repression.